Which bacteria was EcoRI, restriction endonuclease isolated from?

Among hundreds of restriction endonucleases, the Eco R1 enzyme is the most useful and widely investigated enzyme and was isolated from E. coli RY 13